Clinical trial exclusion criteria:
Subjects with hemoglobin SC or SB+ thalassemia
Subjects on chronic transfusion program
Subjects who have received RBC transfusions cannot have >15% adult hemoglobin
Known positive status for HIV, active hepatitis B or hepatitis C
Pregnant or breast feeding women
Individuals with a history of malignancy are ineligible except for the following circumstances. Individuals with a history of malignancy are eligible if they have been disease-free for at least 5 years and are deemed by the investigator to be at low risk for recurrence of that malignancy. Individuals with the following cancer are eligible if diagnosed and adequately treated within the past 5 years: cervical or breast cancer in situ, and basal cell or squamous cell carcinoma of the skin
Subjects with a history of thrombosis or other reason (other than sickle cell disease) for enhanced thrombotic risk
Subjects with unresolved infections
Severe or uncontrolled medical conditions that could compromise study participation
Subjects on fetal hemoglobin inducing agents
Subjects on any other experimental treatment within 90 days of the first dose of study drug or who have not recovered from the side effects of such therapy
Known allergic reaction to a histone deacetylase inhibitor
Subjects who have received valproic acid for treatment of epilepsy within 30 days of enrollment
Subjects who have received any HDAC inhibitors other than valproic acid

Annotated entities:
- Condition: "hemoglobin SC"
- Condition: "SB+ thalassemia"
- Procedure: "transfusion program"
- Qualifier: "chronic"
- Multiplier: "chronic"
- Procedure: "RBC transfusions"
- Negation: "cannot have"
- Value: ">15% adult hemoglobin"
- Condition: "HIV"
- Condition: "hepatitis B"
- Condition: "hepatitis C"
- Temporal: "active"
- Condition: "Pregnant"
- Observation: "breast feeding"
- Person: "women"
- Condition: "malignancy"
- Temporal: "history"
- Condition: "disease-free"
- Temporal: "for at least 5 years"
- Mood: "low risk"
- Condition: "recurrence of that malignancy"
- Condition: "that malignancy"
- Subjective_judgement: "deemed by the investigator"
- Condition: "breast cancer in situ"
- Condition: "cervical cancer in situ"
- Temporal: "within the past 5 years"
- Condition: "squamous cell carcinoma of the skin"
- Condition: "basal cell carcinoma of the skin"
- Grammar_Error: "are eligible"
- Negation: "are eligible"
- Mood: "diagnosed"
- Mood: "adequately treated"
- Procedure: "treated"
- Qualifier: "adequately"
- Condition: "thrombosis"
- Condition: "sickle cell disease"
- Condition: "thrombotic risk"
- Mood: "enhanced risk"
- Temporal: "history"
- Negation: "other than"
- Condition: "thrombotic"
- Condition: "infections"
- Qualifier: "unresolved"
- Condition: "medical conditions"
- Qualifier: "compromise study participation"
- Post-eligibility: "Severe or uncontrolled medical conditions that could compromise study participation"
- Drug: "fetal hemoglobin inducing agents"
- Qualifier: "fetal"
- Post-eligibility: "Subjects on any other experimental treatment within 90 days of the first dose of study drug or who have not recovered from the side effects of such therapy"
- Context_Error: "Subjects on any other experimental treatment within 90 days of the first dose of study drug or who have not recovered from the side effects of such therapy"
- Condition: "allergic reaction"
- Drug: "histone deacetylase inhibitor"
- Drug: "valproic acid"
- Procedure: "treatment"
- Condition: "epilepsy"
- Temporal: "within 30 days of enrollment"
- Reference_point: "enrollment"
- Drug: "HDAC inhibitors"
- Negation: "other than"
- Drug: "valproic acid"